Clinical trial inclusion criterion:
Development of pathological Q waves on ECG.

Entity relations:
- AND("ECG", "pathological Q waves")